Cuál de las siguientes técnicas se considera, según la evidencia disponible, un tratamiento bien establecido en el caso de las fobias infantiles:
1. El entrenamiento en HHSS.
2. Las imágenes emotivas.
3. La terapia basada en el juego.
4. La desensibilización sistemática mediante movimientos oculares.
5. La práctica reforzada.

Respuesta correcta: 5. La práctica reforzada.